Clinical trial exclusion criterion:
History of immunocompromise, including a positive HIV test result.

Annotated entities:
- Condition: "immunocompromise"
- Temporal: "History"
- Measurement: "HIV test"
- Value: "positive"